Other exclusions applied

The above is a clinical trial exclusion criterion. Annotated with entity spans:
[Non-representable: Other exclusions applied]